Clinical trial inclusion criterion:
Endoscopic and histological confirmed diagnosis of intestinal metaplasia,

Entity relations:
- multi("histological confirmed", "histological")
- multi("Endoscopic confirmed", "Endoscopic")
- Has_qualifier("intestinal metaplasia", "Endoscopic confirmed")
- OR("Endoscopic confirmed", "histological confirmed")